High amount of magnesium in blood

The above is a clinical trial exclusion criterion. Annotated with entity spans:
[Value: High amount] of [Measurement: magnesium in blood]